ASA 1 or2.

The above is a clinical trial inclusion criterion. Annotated with entity spans:
[Measurement: ASA] [Value: 1 or2].